5. Age ≥18 years

The above is a clinical trial inclusion criterion. Annotated with entity spans:
[Parsing_Error: 5.] [Person: Age] [Value: ≥18 years]